一名 27 歲女性因昏迷被送到急診室，其呼氣時可察覺有一股強烈苦杏仁氣味，則最應考慮的鑑別診斷是何物中毒？
A. ethylene glycol
B. carbon monoxide
C. carbon tetrachloride
D. cyanide

正確答案：D. cyanide